Pregnants

The above is a clinical trial exclusion criterion. Annotated with entity spans:
[Condition: Pregnants]